Clinical trial exclusion criterion:
4. Known elevated liver enzymes in past clinical trials with any compound (experimental or marketed)

Annotated entities:
- Parsing_Error: "4."
- Measurement: "liver enzymes"
- Value: "elevated"
- Context_Error: "Known elevated liver enzymes in past clinical trials with any compound (experimental or marketed)"
- Non-query-able: "Known elevated liver enzymes in past clinical trials with any compound (experimental or marketed)"